Clinical trial exclusion criterion:
Contraindication to spinal anaesthesia

Entity relations:
- AND("Contraindication", "spinal anaesthesia")